Clinical trial inclusion criterion:
ASA Physical Status II - III

Annotated entities:
- Measurement: "ASA Physical Status"
- Value: "II - III"